Known allergic reaction to a histone deacetylase inhibitor

The above is a clinical trial exclusion criterion. Annotated with entity spans:
Known [Condition: allergic reaction] to a [Drug: histone deacetylase inhibitor]